Serum or plasma creatinine level less than or equal to 2 times the upper limit of normal

The above is a clinical trial inclusion criterion. Annotated with entity spans:
[Qualifier: Serum] or [Qualifier: plasma] [Measurement: creatinine level] [Value: less than or equal to 2 times the upper limit of normal]